Clinical trial exclusion criterion:
Other contraindications mentioned in the "Summary of Product Characteristics" for the respective NOAC.

Annotated entities:
- Condition: "contraindications"
- Qualifier: "Other"
- Qualifier: "Summary of Product Characteristics"
- Drug: "NOAC"